Las principales técnicas en el Entrenamiento de Habilidades Sociales para las personas con esquizofrenia incluyen modelado, ensayo de conducta y retroalimentación. Pero, ¿qué otras técnicas resultan recomendables?:
1. Técnicas de relajación.
2. Técnicas de discusión dirigida y la técnica del grupo nominal (TGN).
3. Técnicas de instigación (Prompting) y aleccionamiento (Coaching).
4. Técnicas de retroalimentación biológica (Biofeedback).
5. Técnicas de conciencia plena (Mindfulness).

Respuesta correcta: 3. Técnicas de instigación (Prompting) y aleccionamiento (Coaching).